Clinical trial exclusion criterion:
Estimated life expectancy <12 months;

Annotated entities:
- Observation: "Estimated life expectancy"
- Value: "<12 months"